Non-pregnant (post-menopausal, surgically sterile or using effective contraceptive measures)

The above is a clinical trial inclusion criterion. Annotated with entity spans:
[Negation: Non]-[Condition: pregnant] ([Condition: post-menopausal], [Condition: surgically sterile] or using [Qualifier: effective] [Procedure: contraceptive measures])